Clinical trial exclusion criterion:
Patients who had history of systemic antibiotic usage over the previous 4 months

Annotated entities:
- Drug: "systemic antibiotic"
- Temporal: "over the previous 4 months"
- Temporal: "history"